Clinical trial exclusion criterion:
Patients with symptomatic CNS metastases or leptomeningeal involvement

Entity relations:
- Has_qualifier("CNS metastases", "symptomatic")
- Has_qualifier("leptomeningeal involvement", "symptomatic")
- OR("CNS metastases", "leptomeningeal involvement")